Clinical trial inclusion criterion:
Patients aged greater than 18 years of age

Annotated entities:
- Person: "aged"
- Value: "greater than 18 years"
- Person: "age"